Students and staff from USC Ostrow school of Dentistry will not be recruited for this study

The above is a clinical trial exclusion criterion. Annotated with entity spans:
[Non-query-able: Students and staff from USC Ostrow school of Dentistry will not be recruited for this study]